Clinical trial inclusion criterion:
Stable dose of NSAIDs including Cyclooxygenase-1 (COX-1) or Cyclooxygenase-2 (COX-2) inhibitors for at least 2 weeks before their Baseline Visit

Annotated entities:
- Drug: "inhibitors Cyclooxygenase-1 (COX-1)"
- Drug: "Cyclooxygenase-2 (COX-2) inhibitors"
- Drug: "NSAIDs"
- Temporal: "for at least 2 weeks before their Baseline Visit"
- Reference_point: "their Baseline Visit"